Clinical trial exclusion criteria:
Women who are pregnant or breastfeeding
Known or suspected, acquired or bleeding or coagulation disorder in the subject or a first degree relative
Active bleeding or at high risk for bleeding.
Brain, spinal, ophthalmologic, or major surgery or trauma within the past 90 days other than the elective knee/hip surgery
Active hepatobiliary disease
Hemoglobin <9 g/dL
Platelet count <100,000/mm3
Creatinine clearance <30 mL/min

Annotated entities:
- Person: "Women"
- Observation: "pregnant"
- Observation: "breastfeeding"
- Mood: "Known"
- Mood: "suspected"
- Condition: "coagulation disorder"
- Condition: "bleeding disorder"
- Condition: "acquired disorder"
- Person: "in the subject"
- Person: "first degree relative"
- Qualifier: "Active"
- Condition: "bleeding"
- Mood: "at high risk for"
- Condition: "bleeding"
- Procedure: "surgery"
- Condition: "trauma"
- Qualifier: "major"
- Qualifier: "ophthalmologic"
- Qualifier: "spinal"
- Qualifier: "Brain"
- Temporal: "within the past 90 days"
- Procedure: "elective knee surgery"
- Procedure: "elective hip surgery"
- Negation: "other than"
- Qualifier: "Active"
- Condition: "hepatobiliary disease"
- Measurement: "Hemoglobin"
- Value: "<9 g/dL"
- Measurement: "Platelet count"
- Value: "<100,000/mm3"
- Measurement: "Creatinine clearance"
- Value: "<30 mL/min"